Clinical trial inclusion criterion:
≥18 years of age undergoing open-heart surgery (sternotomy, including minimally-invasive sternotomies)

Annotated entities:
- Value: "≥18 years"
- Person: "age"
- Procedure: "open-heart surgery"
- Temporal: "undergoing"
- Procedure: "sternotomy"
- Procedure: "minimally-invasive sternotomies"